Exacerbation of chronic diseases;

The above is a clinical trial exclusion criterion. Annotated with entity spans:
[Condition: Exacerbation] of [Condition: chronic diseases];